Clinical trial exclusion criterion:
Pregnancy or nursing (negative pregnancy blood test)

Annotated entities:
- Condition: "Pregnancy"
- Condition: "nursing"
- Value: "negative"
- Measurement: "pregnancy blood test"